Clinical trial exclusion criterion:
Allergy to opioids

Entity relations:
- AND("Allergy", "opioids")